下列有關嚴重急性呼吸道症候群（severe acute respiratory syndrome, SARS）的敘述，何者正確？
A. 致病病毒是 DNA 型病毒
B. 會產生咳嗽和呼吸困難，但不太會發燒
C. 皮膚接觸傳染
D. 採取「隔離」措施，效果佳

正確答案：D. 採取「隔離」措施，效果佳